在標準條件下，下列何者在水解所釋出的自由能（free energy）最大？
A. creatine phosphate
B. phosphoenolpyruvate
C. ATP
D. 1,3-bisphosphoglycerate

正確答案：B. phosphoenolpyruvate